Existen varios tipos de drenajes. Dentro de los aspirativos y de succión se encuentra:
1. Penrose.
2. Kher.
3. Jackson-Pratt.
4. Dedo de guante.

Respuesta correcta: 3. Jackson-Pratt.